Clinical trial exclusion criterion:
An active or a history of a psychiatric disorder including, but not limited to, depression, schizophrenia, bipolar disorder, anxiety, or other psychiatric disorders;

Annotated entities:
- Qualifier: "active"
- Temporal: "history"
- Condition: "psychiatric disorder"
- Condition: "depression"
- Condition: "schizophrenia"
- Condition: "bipolar disorder"
- Condition: "anxiety"
- Condition: "psychiatric disorders"
- Qualifier: "other"